Availability of a signed patient information sheet (Informed Consent form) for participation in the clinical trial.

The above is a clinical trial inclusion criterion. Annotated with entity spans:
[Post-eligibility: Availability of a signed patient information sheet (Informed Consent form) for participation in the clinical trial].